Clinical trial inclusion criterion:
No prior chemotherapy but prior adjuvant chemotherapy finished at least 6 months before enrollment was allowed. (but, prior adjuvant chemotherapy with capecitabine or S-1 or camptothecin analogues was excluded)

Entity relations:
- Has_negation("chemotherapy", "No")
- Has_temporal("chemotherapy", "prior")
- Has_temporal("adjuvant chemotherapy", "prior")
- Has_temporal("adjuvant chemotherapy", "at least 6 months before enrollment")
- Has_temporal("adjuvant chemotherapy", "prior")
- AND("adjuvant chemotherapy", "capecitabine")
- Has_negation("adjuvant chemotherapy", "excluded")
- Has_index("at least 6 months before enrollment", "enrollment")
- Has_negation("adjuvant chemotherapy", "was allowed")
- AND("chemotherapy", "adjuvant chemotherapy")
- OR("capecitabine", "S-1", "camptothecin analogues")